下列何者不是服用 nitrovasodilators 所引起的副作用？
A. Hypotension
B. Lupus-like syndrome
C. Headache
D. Tolerance

正確答案：B. Lupus-like syndrome